Clinical trial exclusion criterion:
Other reason indicating mechanical preparation or contradicting it

Entity relations:
- AND("contradicting", "mechanical preparation")